有關 Bartter 氏症之敘述，下列何者錯誤？
A. 血壓一般正常
B. 血清鎂正常或偏低，代謝性鹼血症
C. 尿中 prostaglandin E2 高值
D. 下行小管枝（descending limb）部位之基因欠損所致

正確答案：D. 下行小管枝（descending limb）部位之基因欠損所致